有關B型肝炎病毒的變異（variants），下列何者錯誤？
A. 核前區G1896A變異與e抗原陰性有關，較不會出現在基因型A的B型肝炎病毒
B. 表面抗原145氨基酸glycine變異成arginine的B型肝炎病毒，會出現在表面抗體（anti-HBs）陽性的個案中
C. Core-promoter的變異，可以導致病毒複製增加及快速進展肝硬化
D. B型肝炎聚合酶YMDD區的變異，與自然演化有關

正確答案：D. B型肝炎聚合酶YMDD區的變異，與自然演化有關